下列關於鋅離子（zinc ion）的敘述，何者錯誤？
A. 鋅離子可與leucine結合後形成leucine zipper，為RNA聚合酶的主要輔助因子
B. 味覺素（gustin）為含鋅離子的唾液蛋白質，缺乏時會抑制味蕾發育與味覺敏銳度
C. 鋅離子參與T細胞與單核球分泌細胞素（cytokines）的過程，缺乏時動物的免疫力會下降
D. 在鉛中毒中，鉛會取代δ-aminolevulinate dehydratase中的鋅離子，會抑制血基質（heme）的合成

正確答案：A. 鋅離子可與leucine結合後形成leucine zipper，為RNA聚合酶的主要輔助因子